下列有關性腺在胚胎發育過程之敘述，何者正確？
A. Testosterone負責男性外生殖器之分化
B. 男性的睪丸及其雄性附屬器官是由wolffian duct所發育而成
C. Müllerian duct可被由睪丸Sertoli cell所分泌之Müllerian-inhibiting substance所抑制
D. Testosterone負責促進睪丸的生成

正確答案：C. Müllerian duct可被由睪丸Sertoli cell所分泌之Müllerian-inhibiting substance所抑制